Clinical trial exclusion criteria:
Existing sacral pressure ulcer, undergoing a cardiac procedure, or inability to provide informed consent.

Annotated entities:
- Condition: "sacral pressure ulcer"
- Procedure: "cardiac procedure"
- Undefined_semantics: "cardiac procedure"
- Condition: "inability to provide informed consent"
- Undefined_semantics: "inability to provide informed consent"
- Non-query-able: "inability to provide informed consent"
- Subjective_judgement: "inability to provide informed consent"